Clinical trial exclusion criterion:
3. Co-interventions: Anticipated pharmacological intervention or procedure or participation in other studies that may interfere with this study.

Annotated entities:
- Parsing_Error: "3."
- Post-eligibility: "Co-interventions: Anticipated pharmacological intervention or procedure or participation in other studies that may interfere with this study."
- Undefined_semantics: "Co-interventions: Anticipated pharmacological intervention or procedure or participation in other studies that may interfere with this study."